With uni-dimensionally measurable disease (at least longest diameter 2 cm on conventional CT scan, x-ray or physical examination, or 1cm on spiral CT scan)

The above is a clinical trial inclusion criterion. Annotated with entity spans:
With [Qualifier: uni-dimensionally measurable] [Condition: disease] ([Value: at least] [Measurement: longest diameter] 2 cm on [Procedure: conventional CT scan], [Procedure: x-ray] or [Procedure: physical examination], or 1cm on [Procedure: spiral CT scan])